Clinical trial inclusion criterion:
Kellgren-Lawrence grade I-III

Entity relations:
- Has_value("Kellgren-Lawrence grade", "I-III")